Able and willing to provide fully informed consent or parent/guardian able to provide consent

The above is a clinical trial inclusion criterion. Annotated with entity spans:
[Informed_consent: Able and willing to provide fully informed consent or parent/guardian able to provide consent]